Clinical trial inclusion criterion:
life expectancy of more than 3 months

Annotated entities:
- Observation: "life expectancy"
- Value: "more than 3 months"